Clinical trial exclusion criterion:
Known hypersensitivity to vaginal progesterone or its excipients

Annotated entities:
- Condition: "hypersensitivity"
- Drug: "vaginal progesterone"
- Drug: "excipients"